Please list the difference between Pyoderma gangrenosum versus chronic venous ulceration?

Diagnosis of Pyoderma gangrenosum(PG) especially when trying to differentiate it from chronic venous ulceration(CVU) requires a number of clinical observations.  1. Pyoderma gangrenosum usually affects the upper and lower legs and feet or peristomal sites compared with chronic venous ulcers that are limited to the lower legs and feet. (2) Pyoderma gangrenosum can be associated with systemic diseases, especially inflammatory bowel disease. (3) Pustules and purulent discharge are features of pyoderma gangrenosum but not of chronic venous ulcers. (4) Crater-like holes or cribriform scarring is commonly seen in pyoderma gangrenosum but not in chronic venous ulcers. (5) Pathergy is a specific but not sensitive finding of pyoderma gangrenosum